Thyroxin (stable dose for ≥ 30 days); The last use of any other prescription medication will need follow the criteria for all other cohorts, as outlined above.

The above is a clinical trial exclusion criterion. Annotated with entity spans:
[Drug: Thyroxin] ([Qualifier: stable dose] for [Temporal: ≥ 30 days]); [Context_Error: The last use of any other prescription medication will need follow the criteria for all other cohorts, as outlined above.]